Ischemic and nonischemic etiology

The above is a clinical trial inclusion criterion. Annotated with entity spans:
[Condition: Ischemic] and [Condition: nonischemic etiology]